Clinical trial inclusion criterion:
Preoperative measurement of corneal astigmatism indicate the subjects are suitable for multifocal intraocular lenses implantation;

Entity relations:
- AND("suitable", "multifocal intraocular lenses implantation")
- Has_value("measurement of corneal astigmatism", "suitable")
- Has_temporal("measurement of corneal astigmatism", "Preoperative")